Clinical trial exclusion criterion:
Cardiogenic shock, ventricular arrhythmia or resuscitated cardiac arrest

Entity relations:
- Has_qualifier("cardiac arrest", "resuscitated")
- OR("Cardiogenic shock", "ventricular arrhythmia", "cardiac arrest")